Clinical trial exclusion criterion:
Molar teeth

Annotated entities:
- Condition: "Molar teeth"